¿A qué está destinada básicamente la primera fase (las cuatro primeras sesiones) de la terapia cognitiva de la depresión basada en la conciencia plena?:
1. A aprender a prestar atención con conciencia plena a diferentes aspectos.
2. A aprender a detectar los cambios del estado de ánimo.
3. A aprender a evitar la ocurrencia de pensamientos o sentimientos negativos.
4. A aprender a elegir cuál es el mejor modo de responder ante los pensamientos o sentimientos negativos.

Respuesta correcta: 1. A aprender a prestar atención con conciencia plena a diferentes aspectos.